Subject has inadequate tissue coverage over the operative site.

The above is a clinical trial inclusion criterion. Annotated with entity spans:
Subject has [Condition: inadequate tissue coverage] over the [Qualifier: operative site].